當我們說腦中組織的"硬化（sclerosis）＂時，意思是指那一種細胞增多？
A. 少突神經膠細胞
B. 神經元
C. 星狀細胞
D. 小神經膠細胞

正確答案：C. 星狀細胞